Clinical trial inclusion criterion:
Elevated blood-cholesterol

Annotated entities:
- Measurement: "blood-cholesterol"
- Value: "Elevated"